indications to dual antiplatelet therapy other than atrial fibrillation or left atrial appendage occlusion at the time of enrollment or predicted appearance of such indications within the duration of the trial (eg. coronary artery disease)

The above is a clinical trial exclusion criterion. Annotated with entity spans:
[Condition: indications] to [Procedure: dual antiplatelet therapy] [Negation: other than] [Condition: atrial fibrillation] or [Condition: left atrial appendage occlusion] [Temporal: at the time of enrollment] or [Mood: predicted appearance] of such indications [Temporal: within the duration of the trial] (eg. [Condition: coronary artery disease])